Subjects who creatinine value is more than two times of the upper limit of the normal range at screening test

The above is a clinical trial exclusion criterion. Annotated with entity spans:
Subjects who [Measurement: creatinine] value is [Value: more than two times of the upper limit of the normal range] [Temporal: at screening test]